Clinical trial inclusion criterion:
Moderate to severe rheumatoid arthritis

Annotated entities:
- Qualifier: "Moderate to severe"
- Condition: "rheumatoid arthritis"